Clinical trial inclusion criterion:
fasting plasma glucose (FPG) =126 mg/dL (7.0 mmol/L)

Annotated entities:
- Measurement: "fasting plasma glucose (FPG)"
- Value: "=126 mg/dL"
- Value: "7.0 mmol/L"